下列關於阿茲海默症的敘述，何者正確？
A. 為持續性、進行性、可逆性病程
B. 意識障礙是首發症狀
C. 病理特徵為老年斑（senile plaques）和神經纖維糾結（neurofibrillary tangles）
D. 疾病早期沒有人格改變

正確答案：C. 病理特徵為老年斑（senile plaques）和神經纖維糾結（neurofibrillary tangles）